Clinical trial exclusion criterion:
Strenuous physical exercise within 3 hours of Visit 1 (Screening)

Entity relations:
- Has_index("within 3 hours of Visit 1 (Screening)", "Visit 1 (Screening)")
- Has_temporal("Strenuous physical exercise", "within 3 hours of Visit 1 (Screening)")